Clinical trial inclusion criterion:
No treatment with insulin or oral agents for 6 months

Entity relations:
- AND("treatment", "insulin")
- Has_temporal("insulin", "for 6 months")
- Has_negation("treatment", "No")
- OR("insulin", "oral agents")